30歲女性，最近幾天發覺右側乳頭有血樣分泌物而就醫。身體檢查發現乳頭並無凹陷，乳房皮膚亦無異常，觸診時並未發現有腫塊存在，腋下淋巴結無腫大現象。她月經週期正常且以口服避孕藥避孕。她的乳房切片 檢查最可能出現何種形態變化？
A. 乳突狀構造
B. 嗜中性白血球浸潤
C. 乳頭表皮出現惡性細胞浸潤
D. 多發性乳管囊狀擴張及乳管周圍組織纖維化

正確答案：A. 乳突狀構造